Clinical trial inclusion criterion:
Aged 18-80

Annotated entities:
- Person: "Aged"
- Value: "18-80"